54歲的陳先生，因數月來漸進性手腳末端無力、肌肉萎縮及肢體僵硬感，被診斷為運動神經元病變，而至門診諮詢其後之照護問題。下列敘述何者錯誤？
A. 具高度遺傳傾向（>50%的可能性）
B. 生命期約2～5年
C. 末期需藉呼吸器維持生命
D. 有藥物可減緩病程惡化

正確答案：A. 具高度遺傳傾向（>50%的可能性）